Clinical trial inclusion criterion:
Platelet count <80,000 or >700,000 cells/mm3, or white blood cell count <3,000 cells/mm3 if persistent (at least 2 abnormal values) within 7 days prior to index procedure.

Annotated entities:
- Measurement: "Platelet count"
- Value: "<80,000 or >700,000 cells/mm3"
- Measurement: "white blood cell count"
- Value: "<3,000 cells/mm3"
- Temporal: "within 7 days prior to index procedure"
- Reference_point: "index procedure"